Clinical trial inclusion criterion:
Adult over 50 years of age.

Entity relations:
- Has_value("age", "over 50 years")